Currently requiring chronic dialysis

The above is a clinical trial exclusion criterion. Annotated with entity spans:
[Temporal: Currently] [Condition: requiring chronic dialysis]